Existe consenso sobre que el tratamiento de los trastornos de la conducta alimentaria debe tener un enfoque:
1. Psicodinámico.
2. De terapia familiar.
3. Cognitivo.
4. Multidisciplinar.
5. Farmacológico.

Respuesta correcta: 4. Multidisciplinar.